Known or suspected infections that are severe, life threatening or are not included in the ABSSSI Food and Drug Administration (FDA) guidance

The above is a clinical trial exclusion criterion. Annotated with entity spans:
Known or suspected [Condition: infections] that are [Qualifier: severe], [Qualifier: life threatening] or are not included in the ABSSSI Food and Drug Administration (FDA) guidance